Clinical trial inclusion criterion:
18 years or older patients who are proven to be infected by Helicobacter pylori based on positive in Urea Breath Test or positive in histopathologic examination of biopsy in antrum and corpus of gaster through esophagoduodenoscopy.

Annotated entities:
- Value: "18 years or older"
- Condition: "infected by Helicobacter pylori"
- Value: "positive"
- Measurement: "Urea Breath Test"
- Value: "positive"
- Procedure: "histopathologic examination of biopsy"
- Qualifier: "antrum of gaster"
- Qualifier: "corpus of gaster"
- Procedure: "esophagoduodenoscopy"
- Person: "old"